Clinical trial exclusion criterion:
Previous treatment with CPAP

Entity relations:
- AND("treatment", "CPAP")
- Has_temporal("treatment", "Previous")